Clinical trial inclusion criterion:
diagnosis of moderate to very severe COPD (FEV1 <80% predicted), according to the GesEPOC criteria, established at least 3 months

Entity relations:
- Has_value("FEV1", "<80% predicted")
- Has_temporal("COPD", "at least 3 months")
- Has_qualifier("COPD", "moderate")
- AND("GesEPOC criteria,", "COPD")
- AND("COPD", "FEV1")
- OR("moderate", "very severe")